patients scheduled to undergo hip arthroplasty

The above is a clinical trial inclusion criterion. Annotated with entity spans:
patients [Mood: scheduled to undergo] [Procedure: hip arthroplasty]